El CO es tóxico para los organismos aerobios:
1. Porque oxida los grupos OH de la hemoglobina, evitando que esta pueda fijar O2 correctamente.
2. Porque entra en la mitocondria, recogiendo los electrones de la cadena de transporte con menor eficiencia que el O2.
3. Porque se une al grupo hemo con mayor afinidad que el O2.
4. Porque al tener un mayor carácter dipolar, es más soluble que el O2 en sangre y bloquea el intercambio de O2 entre aire y sangre a nivel de los pulmones.
5. Ninguna de las anteriores es correcta.

Respuesta correcta: 3. Porque se une al grupo hemo con mayor afinidad que el O2.